Clinical trial exclusion criterion:
gastrointestinal problems or musculoskeletal disorders that would prevent them to follow the test diets or exercise interventions

Entity relations:
- Has_negation("test diets", "prevent")
- multi("prevent", "prevent")
- AND("gastrointestinal problems", "test diets")
- OR("test diets", "exercise interventions")
- OR("gastrointestinal problems", "musculoskeletal disorders")